Clinical trial inclusion criterion:
Participants having H. pylori related chronic gastritis with/without peptic ulcers who are aged greater than 20 years old and are willing to received eradication therapy.

Annotated entities:
- Qualifier: "H. pylori related"
- Condition: "chronic gastritis"
- Condition: "peptic ulcers"
- Person: "aged"
- Value: "greater than 20 years old"
- Procedure: "eradication therapy"
- Mood: "willing to receive"